上肢藉下列何者附著於軀幹？
A. 肩鎖關節（acromioclavicular joint）
B. 盂肱關節（glenohumeral joint）
C. 胸鎖關節（sternoclavicular joint）
D. 柄胸關節（manubriosternal joint）

正確答案：C. 胸鎖關節（sternoclavicular joint）